Clinical trial exclusion criterion:
14. Serum potassium<3.2mmol/L, or>5.5mmol/L;

Entity relations:
- Has_value("Serum potassium", "<3.2mmol/L")
- OR("<3.2mmol/L", ">5.5mmol/L")